Clinical trial exclusion criterion:
Patient treated with drugs supposed to alter gastric emptying times (calcium antagonists, Alimentary tract treatments, opioid analgesics, tricyclic antidepressants, antibiotics).

Annotated entities:
- Drug: "calcium antagonists"
- Procedure: "Alimentary tract treatments"
- Drug: "opioid analgesics"
- Drug: "tricyclic antidepressants"
- Drug: "antibiotics"
- Drug: "drugs supposed to alter gastric emptying times"